Absolute contraindication to CMR

The above is a clinical trial exclusion criterion. Annotated with entity spans:
Absolute [Condition: contraindication] to [Procedure: CMR]